一位20歲女性割腕自殺被送至急診室時，左手腕掌面橈側有約3公分橫向刀口，神經學檢查發現手掌五指可伸直及併指，但無法彎曲握拳，且手指腹面有麻木感，則此病人最可能為下列那一條神經受損？
A. 橈神經（radial nerve）
B. 指神經（digital nerve）
C. 正中神經（median nerve）
D. 尺神經（ulnar nerve）

正確答案：C. 正中神經（median nerve）